BMI 25.0 - 45.0 kg/m2

The above is a clinical trial inclusion criterion. Annotated with entity spans:
[Measurement: BMI] [Value: 25.0 - 45.0 kg/m2]